Clinical trial exclusion criterion:
Polycystic ovary syndrome (PCOS) according to Rotterdam Consensus Criteria (European Society of Human Reproduction and Embryology [ESHRE]/American Society for Reproductive Medicine [ASRM], 2003)

Annotated entities:
- Condition: "Polycystic ovary syndrome (PCOS)"
- Qualifier: "Rotterdam Consensus Criteria"
- Qualifier: "European Society of Human Reproduction and Embryology [ESHRE]/American Society for Reproductive Medicine [ASRM], 2003"